Clinical trial exclusion criterion:
Contraindication to aspirin or P2Y12 receptor antagonist

Annotated entities:
- Condition: "Contraindication"
- Condition: "aspirin"
- Condition: "P2Y12 receptor antagonist"